郭先生今年 56 歲，半年前開始肌肉逐漸萎縮無力，先是從手掌開始，然後漸漸擴展到上臂，接著兩下肢也受到侵犯。理學檢查發現四肢肌肉萎縮；但肌腱反射反而增強，下顎反射（jaw jerk）也增強；另外，肌肉偶爾會有小小的不規則跳動，到處都有，連舌頭也會。說話時有一點鼻音，喝水偶爾會嗆到。感覺系統則沒有任何異常。郭先生最有可能罹患下列那一項疾病？
A. 肌萎縮脊髓側索硬化症（amyotrophic lateral sclerosis）
B. 慢性發炎性脫髓鞘型多發神經病變（chronic inflammatory demyelinating polyneuropathy）
C. 多發性硬化症（multiple sclerosis）
D. 脊髓空洞症（syringomyelia）

正確答案：A. 肌萎縮脊髓側索硬化症（amyotrophic lateral sclerosis）